關於支氣管擴張症，下列敘述何者正確？
A. 是 Goodpasture 氏症候群三大病徵之一
B. 多半侵犯上葉
C. 多半侵犯近端支氣管
D. 主要致因是阻塞及感染

正確答案：D. 主要致因是阻塞及感染